Mujer de 37 años afecta de una colitis ulcerosa extensa, presenta un brote grave por el que se inicia tratamiento con prednisona en dosis de 1 mg/Kg. Tras una semana de tratamiento, la paciente no presenta mejoría. ¿Cuál es la siguiente medida terapéutica a realizar?
1. Colectomía subtotal de urgencia y en un segundo tiempo proctectomía y reservorio ileoanal.
2. Asociar un inmunosupresor como azatioprina.
3. Asociar mesalazina en dosis de 4 gramos al día oral y triamcinolona rectal 1 aplicación cada 12 horas
4. Ciclosporina endovenosa 2 mg/Kg.
5. Debe valorarse el tratamiento con etanercept (un anticuerpo anti-TNFa).

Respuesta correcta: 4. Ciclosporina endovenosa 2 mg/Kg.